下列何者是 DNA 包裹的層次次序：
A. DNA→核小體（nucleosome）→染色質原纖維（chromatin fibril）→染色質纖維圈套（chromatin fiber looping）→染色體（chromosome）
B. DNA→染色質原纖維→核小體→染色體→染色質纖維圈套
C. DNA→核小體→染色質纖維圈套→染色質原纖維→染色體
D. DNA→染色質原纖維→染色質纖維圈套→核小體→染色體

正確答案：A. DNA→核小體（nucleosome）→染色質原纖維（chromatin fibril）→染色質纖維圈套（chromatin fiber looping）→染色體（chromosome）